有關普利昂病（prion disease）腦組織病理變化的特點，下列何者錯誤？
A. 海綿樣病變（spongiform change）
B. 明顯的發炎性細胞浸潤
C. 免疫細胞化學反應（immunocytochemistry）可見普利昂蛋白（prion protein）沉積物
D. 神經元細胞數量減少且合併星狀膠質細胞增生（astrocytosis）

正確答案：B. 明顯的發炎性細胞浸潤